Significant pulmonary disease, (e.g., restrictive pulmonary disease, constrictive or chronic obstructive pulmonary disease) or any other disease or malfunction of the lungs or respiratory system that produces chronic symptoms.

The above is a clinical trial exclusion criterion. Annotated with entity spans:
[Qualifier: Significant] [Condition: pulmonary disease], (e.g., [Condition: restrictive pulmonary disease], [Condition: constrictive] or [Condition: chronic obstructive pulmonary disease]) or [Qualifier: any other] [Condition: disease] or [Condition: malfunction of the lungs] or respiratory system that produces [Condition: chronic symptoms].